Clinical trial exclusion criterion:
Food allergies (other than controlled Coeliac Disease)

Annotated entities:
- Condition: "Food allergies"
- Negation: "other"
- Condition: "Coeliac Disease"